Clinical trial exclusion criterion:
Known other respiratory disorders or signs for other respiratory disorders (e.g. asthma, lung cancer, sarcoidosis, tuberculosis, lung fibrosis, cystic fibrosis, bronchoectasis).

Annotated entities:
- Condition: "respiratory disorders"
- Condition: "signs for respiratory disorders"
- Condition: "asthma"
- Condition: "lung cancer"
- Condition: "sarcoidosis"
- Condition: "tuberculosis"
- Condition: "lung fibrosis"
- Condition: "cystic fibrosis"
- Condition: "bronchoectasis"